有關乳房之乳突狀瘤（Papilloma）之敘述，何者正確？
A. 單一個乳突狀瘤通常發生在乳部外圍小葉處（Lobular unit）
B. 單一個乳突狀瘤不可能演變成乳癌
C. 乳突狀瘤通常會有血水或血樣乳頭分泌物，且是單側性發生
D. 這種瘤在顯微鏡下只可觀察到沒有上皮細胞（Epithelium）之結締組織

正確答案：C. 乳突狀瘤通常會有血水或血樣乳頭分泌物，且是單側性發生